陳小姐是 21 歲女性，過去有脊柱裂（spina bifida）的病史，因最近四天發燒、畏寒及兩側肋脊角疼痛而送來急診。她有放置導尿管，自述過去曾有類似的症狀十幾次了。從小就被醫師告知是「腎臟及膀胱神經敏感症」。因為此一問題服用過很多藥物。理學檢查發現病人體溫 40℃，腹部柔軟但有 些壓痛，兩側肋脊角有明顯的敲痛，集尿袋可發現血尿。下列何者是此病人最可能的診斷？
A. 急性出血性膀胱炎
B. 急性腎絲球腎炎
C. 急性腎盂腎炎
D. Berger 氏病（IgA 腎病變）

正確答案：C. 急性腎盂腎炎